Clinical trial exclusion criterion:
Severe concomitant disease with life expectation < 1 year

Annotated entities:
- Condition: "Severe disease"
- Measurement: "life expectation"
- Value: "< 1 year"
- Temporal: "concomitant"